Hypersensitivity to a PCC

The above is a clinical trial exclusion criterion. Annotated with entity spans:
[Condition: Hypersensitivity] to a [Drug: PCC]